Clinical trial exclusion criterion:
Refusal of treatment or contraindication to NeuroAiD

Entity relations:
- AND("contraindication", "NeuroAiD")